Clinical trial exclusion criterion:
Exclusions Based on Other Medical Conditions

Annotated entities:
- Parsing_Error: "Exclusions Based on Other Medical Conditions"